Clinical trial exclusion criterion:
Use of other investigational study drugs within 1 year prior to study entry

Entity relations:
- Has_temporal("investigational study drugs", "within 1 year prior to study entry")